inability to take oral medication.

The above is a clinical trial exclusion criterion. Annotated with entity spans:
[Mood: inability] to take [Drug: oral medication].